Clinical trial exclusion criterion:
Patients who are prescribed AEDs not listed in the trial IMPs

Annotated entities:
- Non-query-able: "Patients who are prescribed AEDs not listed in the trial IMPs"